Neonatal intensive care unit admission

The above is a clinical trial exclusion criterion. Annotated with entity spans:
[Visit: Neonatal intensive care unit] admission